有關嗜肺性退伍軍人桿菌（Legionella pneumophila）的敘述，下列何者錯誤？
A. 培養時需在培養基中添加L-胱胺酸（L-cysteine）
B. 可在巨噬細胞（macrophages）內繁殖
C. 會引起龐地克熱（Pontiac fever）和肺炎兩型，而以龐地克熱死亡率較高
D. 經常由中央空調散佈

正確答案：C. 會引起龐地克熱（Pontiac fever）和肺炎兩型，而以龐地克熱死亡率較高